Clinical trial exclusion criterion:
Severe physical or psychological concomitant diseases that might impair compliance with the provisions of the study protocol or that might impair the assessment of drug or patient safety, e.g. clinically significant ascites, cardiac failure, NYHA III or IV, clinically relevant pathologic findings in ECG

Annotated entities:
- Condition: "physical diseases"
- Condition: "psychological diseases"
- Condition: "ascites"
- Qualifier: "clinically significant"
- Condition: "cardiac failure"
- Measurement: "NYHA"
- Value: "III or IV"
- Qualifier: "clinically relevant"
- Observation: "pathologic findings"
- Procedure: "ECG"